4. Viable, granulating wound (investigator discretion)

The above is a clinical trial inclusion criterion. Annotated with entity spans:
[Parsing_Error: 4.] [Qualifier: Viable], [Qualifier: granulating] [Condition: wound] ([Subjective_judgement: investigator discretion])